有關人類的彩色視覺，下列何者是最恰當的敘述？
A. 正常人類視網膜上的M型錐細胞（M cones）主要吸收紅光
B. 人類視覺的三原色是指紅色、綠色與黃色
C. 人類男性與女性色盲發生的比率為1：1
D. 錐細胞（cone）辨別紅色與綠色的基因，同時位於X染色體上且位置相近

正確答案：D. 錐細胞（cone）辨別紅色與綠色的基因，同時位於X染色體上且位置相近